Clinical trial exclusion criterion:
Bleeding tendency or coagulopathy

Entity relations:
- OR("Bleeding tendency", "coagulopathy")